有關胰島素受體（insulin receptor）訊息傳遞的敘述，下列何者正確？
A. 胰島素受體是nuclear hormone receptor
B. 胰島素受體利用cAMP進行訊息傳遞
C. 胰島素受體會磷酸化自己及其受質（substrate）
D. 胰島素受體在胰島素刺激前，是一種活化的磷酸激酶

正確答案：C. 胰島素受體會磷酸化自己及其受質（substrate）